Mujer de 76 años intervenida quirúrgicamente de catarata en su ojo izquierdo dos años antes sin complicaciones. Refiere que desde hace unos meses tiene la sensación de que se le ha reproducido la catarata. Señale el diagnóstico más probable.
1. Catarata    secundaria     por     extracción incompleta del cristalino.
2. Opacificación de la cápsula posterior.
3. Edema macular quístico.
4. Luxación de lente intraocular a la cavidad vítrea.
5. Endoftalmitis tardía.

Respuesta correcta: 2. Opacificación de la cápsula posterior.